Clinical trial inclusion criterion:
HIV negative by 4th generation test (Ag/Ab test) or combination of enzymeimmunoassay (EIA) and HIV RNA

Entity relations:
- Has_value("HIV 4th generation test", "negative")
- Subsumes("HIV 4th generation test", "Ag/Ab test")
- Subsumes("enzymeimmunoassay", "EIA")
- Has_value("enzymeimmunoassay", "negative")
- OR("HIV 4th generation test", "enzymeimmunoassay")